La actividad de corrección de pruebas de la DNA Polimerasa:
1. Es una actividad exonucleasa 5´-3´.
2. Es una actividad exonucleasa 3´-5´.
3. Es una actividad polimerizante 5´-3´.
4. Es una actividad endonucleasa.
5. Es una actividad transesterificadora.

Respuesta correcta: 2. Es una actividad exonucleasa 3´-5´.